En la biosíntesis de proteínas, durante el proceso de traducción tiene lugar el apareamiento de bases entre:
1. EL ARN y el ADN.
2. El ADN y el ARN ribosómico.
3. El ARN de transferencia y el ARN ribosómico.
4. El ARN mensajero y el ARN de transferencia.
5. El ARN ribosómico 18S y el ARN ribosómico 5S.

Respuesta correcta: 4. El ARN mensajero y el ARN de transferencia.